Clinical trial exclusion criterion:
Previous organ transplantation

Annotated entities:
- Temporal: "Previous"
- Procedure: "organ transplantation"